Clinical trial inclusion criterion:
Born, raised and currently living at low altitude (<800m).

Annotated entities:
- Non-query-able: "Born, raised and currently living at low altitude (<800m)"